貼膚試	（patch test） 是下列何種皮膚疾病的標準診斷方法？
A. 乾癬（psoriasis）
B. 多形性紅斑（erythema multiforme）
C. 慢性蕁麻疹（chronic urticaria）
D. 過敏性接觸性皮膚炎（allergic contact dermatitis）

正確答案：D. 過敏性接觸性皮膚炎（allergic contact dermatitis）